23 歲女性，G1P0，姙娠 30 週，其胎兒腹部超音波檢查發現「雙泡徵」（double-bubble sign），請問下列診斷中何者最為可能？
A. 神經管缺損
B. 臍膨出
C. 十二指腸閉鎖
D. 唐氏症

正確答案：C. 十二指腸閉鎖